緊急處理新生兒氣胸（pneumothorax）時，可於胸壁那個位置垂直插入引流針治療？
A. 第一肋間隙（intercostal space）
B. 第二肋間隙
C. 第三肋間隙
D. 第四肋間隙

正確答案：D. 第四肋間隙